Clinical trial inclusion criterion:
Affiliate to social security or beneficiary of such a regime

Entity relations:
- OR("Affiliate to social security", "social security beneficiary")